History of deep venous insufficiency, chronic venous leg ulcer or stasis dermatitis

The above is a clinical trial exclusion criterion. Annotated with entity spans:
[Temporal: History] of [Condition: deep venous insufficiency], [Condition: chronic venous leg ulcer] or [Condition: stasis dermatitis]